Clinical trial exclusion criterion:
History of hypersensitivity to EACA

Entity relations:
- AND("hypersensitivity", "EACA")